Undergoing Interleukin-2 (IL-2) therapy within 8 weeks of study entry

The above is a clinical trial exclusion criterion. Annotated with entity spans:
Undergoing [Procedure: Interleukin-2 (IL-2) therapy] [Temporal: within 8 weeks of study entry]